What is another name for acid sphingomyelinase deficiency (ASMD)?

Historically, ASMD has been classified as Niemann-Pick disease (NPD) types A (NPD A) and B (NPD B). The clinical spectrum distinguishes a severe infantile neurological form (type A), a non-neurological visceral form (type B) and a rare intermediate neurovisceral form.